Clinical trial inclusion criterion:
Age between 2 to <17 years at Visit 2.

Entity relations:
- Has_temporal("Age", "at Visit 2")
- Has_value("Age", "between 2 to <17 years")